Which enzyme is inhibited by Varespladib?

Varespladib is a secretory phospholipase A2 (sPLA2) inhibitor. It was tested in patients with acute coronary syndrome.